Ruptured membranes

The above is a clinical trial exclusion criterion. Annotated with entity spans:
[Condition: Ruptured membranes]